噪音引起的聽力喪失，初期在多少赫茲（Hz）處最為明顯，而形成聽力圖上的凹陷（dip）現象？
A. 2000
B. 4000
C. 6000
D. 8000

正確答案：B. 4000